Clinical trial inclusion criteria:
1. Male or female of any race, at least 18 years of age at Visit 1 Screening.
2. Has provided verbal and written informed consent.
3. Be able and willing to follow instructions, including participation in all study assessments and visits.
4. Currently being treated for glaucoma using at least two medications, and be willing to continue on the same regime.
5. Suffers from at least two of the symptoms in the GLIA™ Glaucoma Medication Ocular Side Effect Symptoms Questionnaire at a severity of 2 (moderate) or more.
6. If a woman of childbearing potential, have a negative urine pregnancy test at Visit 1 and be using an adequate method of birth control throughout the study period.

Annotated entities:
- Parsing_Error: "1."
- Person: "Male"
- Person: "female"
- Value: "at least 18 years"
- Person: "age"
- Temporal: "at Visit 1 Screening"
- Reference_point: "Visit 1 Screening"
- Parsing_Error: "2."
- Post-eligibility: "Has provided verbal and written informed consent."
- Non-query-able: "Has provided verbal and written informed consent."
- Parsing_Error: "3."
- Post-eligibility: "Be able and willing to follow instructions, including participation in all study assessments and visits."
- Non-query-able: "Be able and willing to follow instructions, including participation in all study assessments and visits."
- Parsing_Error: "4."
- Condition: "glaucoma"
- Procedure: "treated"
- Temporal: "Currently"
- Multiplier: "at least two"
- Drug: "medications"
- Undefined_semantics: "medications"
- Non-query-able: "willing to continue"
- Parsing_Error: "5."
- Multiplier: "at least two"
- Condition: "symptoms"
- Measurement: "GLIA™ Glaucoma Medication Ocular Side Effect Symptoms Questionnaire"
- Value: "severity of 2 or more"
- Value: "moderate"
- Parsing_Error: "6."
- Person: "woman"
- Condition: "childbearing potential"
- Measurement: "urine pregnancy test"
- Value: "negative"
- Temporal: "at Visit 1"
- Reference_point: "Visit 1"
- Device: "method of birth control"
- Qualifier: "adequate"
- Subjective_judgement: "adequate"
- Temporal: "throughout the study period"
- Reference_point: "study period"